Able to communicate well with the investigators

The above is a clinical trial inclusion criterion. Annotated with entity spans:
[Non-query-able: Able to communicate well with the investigators]